What is molecular radiotherapy?

Molecular radiotherapy is working through tumor-targeted radionuclides.